Clinical trial exclusion criterion:
Pregnant or breastfeeding women

Annotated entities:
- Condition: "Pregnant"
- Observation: "breastfeeding"
- Person: "women"